Clinical trial exclusion criterion:
Osteoporosis

Annotated entities:
- Condition: "Osteoporosis"